一位 1 個月大之男嬰來診主訴食慾很差；理學檢查時發現有肝腫大。若再有下列何種臨床表徵最可能確信其患有代謝性肝病？
A. 皮膚血管瘤
B. 灰白便
C. 小頭症
D. 嬰兒身體有不尋常氣味

正確答案：D. 嬰兒身體有不尋常氣味